Clinical trial inclusion criterion:
1. Males and females ≥ 18 years old.

Entity relations:
- Has_value("old", "≥ 18 years old")
- OR("Males", "females")